Clinical trial exclusion criterion:
Other spinal pathology or other associated medical condition

Entity relations:
- OR("spinal pathology", "associated medical condition")